Clinical trial exclusion criterion:
History of recent gastro-intestinal bleeding

Entity relations:
- Has_temporal("gastro-intestinal bleeding", "recent")